List types of cancer where Long intergenic nonprotein coding RNA p53-induced transcript (LINC-PINT) is involved

Long intergenic nonprotein coding RNA p53-induced transcript (LINC-PINT) is involved in the development of pancreatic cancer, glioblastoma and breast cancer.